Presence of VTE upon admission

The above is a clinical trial exclusion criterion. Annotated with entity spans:
Presence of [Condition: VTE] [Temporal: upon admission]